Una neurona motora y todas las fibras musculares que inerva constituyen:
1. Placa motora.
2. Unidad motora.
3. Unión neuromuscular.
4. Sinapsis motora.
5. Filamento motor.

Respuesta correcta: 2. Unidad motora.